1. Prior treatment with gemcitabine, carboplatin (except in the adjuvant setting), or Iniparib.

The above is a clinical trial exclusion criterion. Annotated with entity spans:
1. [Temporal: Prior] treatment with [Drug: gemcitabine], [Drug: carboplatin] (except in the adjuvant setting), or [Drug: Iniparib].